Patient or physician refusal to enroll in the study

The above is a clinical trial inclusion criterion. Annotated with entity spans:
[Post-eligibility: Patient or physician refusal to enroll in the study]